Clinical trial exclusion criterion:
Neurological or medical conditions that would interfere with MRI scanning (e.g. history of stroke, seizure, brain tumor, brain infection, traumatic brain injury, multiple sclerosis, dementia, metal device in body, pregnancy, claustrophobia, color blindness, severe hearing impairment, weight>300 lbs., wheelchair-bound)

Entity relations:
- AND("medical conditions", "interfere")
- AND("interfere", "MRI scanning")
- Has_qualifier("hearing impairment", "severe")
- Has_value("weight", ">300 lbs.")
- OR("medical conditions", "conditions Neurological")